下列有關胃的敘述，何者正確？
A. 胃酸由主細胞（chief cell）製造
B. 主細胞（chief cell）可分泌胃蛋白酶原
C. 具分化能力的幹細胞分布在胃腺底部
D. 分泌胃泌素（gastrin）之腸道內分泌細胞集中在賁門部

正確答案：B. 主細胞（chief cell）可分泌胃蛋白酶原